庫賈氏病（Creutzfeldt-Jakob disease）致病因子的主要組成成分是：
A. 蛋白質
B. RNA
C. DNA
D. 脂肪

正確答案：A. 蛋白質